30 歲病患平日無高血壓病史，今因故須手術，全身麻醉誘導時，血壓竄升至 220/150 mmHg，因而中止麻醉。送回恢復室時，高血壓又發作幾次，為正確診斷，要做下列何種檢查？
A. 血鉀及 Aldosterone
B. 血中 Cortisol
C. 血中 24 小時 Metanephrine 及 Vallinyl mandelic acid（VMA）
D. 血中 Renin

正確答案：C. 血中 24 小時 Metanephrine 及 Vallinyl mandelic acid（VMA）